Clinical trial exclusion criterion:
Contraindication to regional anesthesia e.g. bleeding diathesis, coagulopathy

Entity relations:
- Subsumes("Contraindication", "bleeding diathesis")
- AND("Contraindication", "regional anesthesia")
- OR("bleeding diathesis", "coagulopathy")